List genes associated with hypolipidemia.

PCSK9
APOB 
ANGPTL3
ANGPTL4
MTP